What is a likely origin of intronless genes?

The origin of intronless genes is most likely retrotransposition